Patients who are currently receiving quetiapine therapy may not undergo a washout period and then restart quetiapine in the study.

The above is a clinical trial exclusion criterion. Annotated with entity spans:
[Non-representable: Patients who are currently receiving quetiapine therapy may not undergo a washout period and then restart quetiapine in the study].